Clinical trial inclusion criterion:
18 years of age or older

Annotated entities:
- Person: "age"
- Value: "18 years or older"